Stage I (140-159/90-99 mmHg) untreated subjects with essential hypertension

The above is a clinical trial inclusion criterion. Annotated with entity spans:
[Qualifier: Stage I] (140-159/90-99 mmHg) [Qualifier: untreated] subjects with [Condition: essential hypertension]